以下有關新生兒兩側性腎缺乏（renal agenesis）之敘述，何者不正確？
A. 超音波看不到膀胱
B. 具有波特臉（Potter facies）
C. 通常在出生後 48 小時內死於腎衰竭，除非儘早做透析治療
D. 母親羊水少（oligohydramnios）

正確答案：C. 通常在出生後 48 小時內死於腎衰竭，除非儘早做透析治療